Clinical trial exclusion criterion:
Preoperative history of schizophrenia, epilepsy, parkinsonism or myasthenia gravis;

Entity relations:
- Has_temporal("history", "Preoperative")
- Has_temporal("schizophrenia", "history")
- OR("schizophrenia", "epilepsy", "parkinsonism", "myasthenia gravis")